¿Cuál de las siguientes características es propia del reflejo miotáctico inverso?:
1. Es monosináptico.
2. La respuesta del músculo homónimo es una contracción refleja.
3. El receptor desencadenante es el huso muscular.
4. La respuesta del músculo homónimo es una relajación refleja.

Respuesta correcta: 4. La respuesta del músculo homónimo es una relajación refleja.